there is no inoculation history of EV71 vaccine, and there is no history of EV71 infection

The above is a clinical trial inclusion criterion. Annotated with entity spans:
there is [Negation: no] [Procedure: inoculation] [Temporal: history] of [Drug: EV71 vaccine], and there is [Negation: no] [Temporal: history] of [Condition: EV71 infection]